Clinical trial inclusion criterion:
scheduled for elective cesarean delivery

Entity relations:
- Has_mood("cesarean delivery", "scheduled for")
- Has_qualifier("cesarean delivery", "elective")